Clinical trial exclusion criterion:
History of allergic reactions attributed to compounds of similar chemical or biologic composition to misoprostol

Entity relations:
- multi("compounds of similar chemical or biologic composition to misoprostol", "misoprostol")
- AND("allergic reactions", "compounds of similar chemical or biologic composition to misoprostol")
- Has_temporal("allergic reactions", "History")